Clinical trial exclusion criterion:
Dementia - diagnosed and/or MoCA score <18

Annotated entities:
- Condition: "Dementia"
- Measurement: "MoCA score"
- Value: "<18"